Clinical trial inclusion criterion:
No previous iron supplementation

Annotated entities:
- Negation: "No"
- Temporal: "previous"
- Procedure: "iron supplementation"